Clinical trial inclusion criterion:
hospital admission for COPD exacerbation

Entity relations:
- AND("admission", "COPD exacerbation")